Hombre de 73 años de edad, exfumador, antecedentes de HTA, obesidad grado II, diabetes tipo 2 y EPOC grave con oxigenoterapia crónica domiciliaria. Acude a Urgencias por aumento progresivo de su disnea habitual,     expectoración        purulenta     y temperatura de 37.9ºC de 4 días de evolución. Su médico de cabecera le había prescrito 2 días antes moxifloxacino, paracetamol, deflazacort, aerosolterapia y aumento del flujo de oxígeno. A la exploración física el paciente se encuentra con regular estado general, consciente, tendencia al sueño, taquipneico a 28 rpm y utilización de musculatura accesoria, temperatura 38,2ºC, saturación de oxigeno de 87%, TA 115/62 mmHg, frecuencia cardiaca 110 lpm; murmullo vesicular disminuido globalmente, sibilancias y roncus dispersos y crepitantes húmedos en bases. En la analítica destaca leucocitos 16.500/uL con 14.900 neutrófilos, hemoglobina 14 g/dL, glucosa 240 mg/dL, urea 56 mg/dL, creatinina 1.3 mg/dL, Na 133 mEq/L, K 3.7 mEq/L. En el ECG se objetiva taquicardia sinusal. La gasometría arterial muestra: pH 7,29, pCO2 64 mmHg, pO2 59 mmHg, HCO3 28 mg/dL. En la radiografía de tórax no se aprecia condensación ni derrame pleural. ¿Cuál de las siguientes   opciones    de   manejo     clínico instauraría en primer lugar?
1. Iniciar      tratamiento    con      diuréticos intravenosos, oxígeno con mascarilla a alto flujo al 50% y seguir con el resto de tratamiento ya prescrito.
2. Iniciar tratamiento con aerosoles de salbutamol y esteroides, añadir al tratamiento antibiótico una cefalosporina, intensificar la oxigenoterapia con oxígeno en gafas nasales a 4 litros por minuto y mantener deflazacort.
3. Iniciar tratamiento de la acidosis con bicarbonato 1M, corregir la hiperglucemia, mantener tratamiento antibiótico y prescribir esteroides más diuréticos intravenosos.
4. Dada la situación de gravedad del paciente se procedería a la intubación orotraqueal previa preparación          (preoxigenación          y premedicación) y avisar a Medicina Intensiva.
5. Iniciar el tratamiento con ventilación mecánica no invasiva (modo presión positiva de dos niveles), prescribir aerosoles de salbutamol y esteroides intravenosos y mantener tratamiento antibiótico por vía intravenosa.

Respuesta correcta: 5. Iniciar el tratamiento con ventilación mecánica no invasiva (modo presión positiva de dos niveles), prescribir aerosoles de salbutamol y esteroides intravenosos y mantener tratamiento antibiótico por vía intravenosa.